5. Patients in Highly allergic constitution

The above is a clinical trial exclusion criterion. Annotated with entity spans:
5. Patients in [Condition: Highly allergic constitution]